Clinical trial exclusion criterion:
Renal failure on dialysis

Entity relations:
- AND("Renal failure", "dialysis")